下列何種心包炎最易進展至窄縮性心包炎（constrictive pericarditis）？
A. 漿液性心包炎（serous pericarditis）
B. 纖維蛋白性心包炎（fibrinous pericarditis）
C. 漿液纖維蛋白性心包炎（serofibrinous pericarditis）
D. 化膿性心包炎（suppurative pericarditis）

正確答案：D. 化膿性心包炎（suppurative pericarditis）